Clinical trial exclusion criterion:
Less than 18 years of age;

Annotated entities:
- Value: "Less than 18 years"
- Person: "age"